A un individuo se le diagnostica Síndrome de Zollinger-Ellison. ¿Cuál de los siguientes datos es consistente con el diagnóstico?:
1. Disminución de las concentraciones séricas de gastrina.
2. Aumento de las concentraciones séricas de insulina.
3. Disminución de la secreción gástrica de H+.
4. Desarrollo de úlcera gastrointestinal.

Respuesta correcta: 4. Desarrollo de úlcera gastrointestinal.